Be able to speak, read and write English and follow simple instructions for completing self-rated scales

The above is a clinical trial inclusion criterion. Annotated with entity spans:
Be [Observation: able to speak, read and write English] and follow simple instructions for completing self-rated scales